下列何者不屬於腫瘤伴生症候群（paraneoplastic syndrome）？
A. 皮肌炎（dermatomyositis）
B. 邊緣性腦炎（limbic encephalitis）
C. 小腦退化（cerebellar degeneration）
D. 亞急性合併退化症（subacute combined degeneration）

正確答案：D. 亞急性合併退化症（subacute combined degeneration）